La quimotripsina es una enzima digestiva con actividad:
1. DNAsa.
2. Proteasa.
3. RNAsa.
4. Lipasa.
5. Glicosidasa.

Respuesta correcta: 2. Proteasa.